(3)If a study participant is a woman of childbearing age, she agrees to use a reliable contraceptive method during the trial;

The above is a clinical trial inclusion criterion. Annotated with entity spans:
(3)If a study participant is a [Person: woman] of [Observation: childbearing age], she [Mood: agrees to use] a [Qualifier: reliable] [Observation: contraceptive method] [Temporal: during the trial];